下列何種疾病會導致一個無收縮性膀胱（flaccid bladder）？
A. 胸脊髓及腰脊髓損傷
B. 腦中風
C. 多發性硬化症
D. 糖尿病

正確答案：D. 糖尿病